失眠的病人需要處方安眠藥時，下列那些衛教或處置最恰當？
A. 處方安眠藥時，宜確定排除睡眠呼吸中止症候群
B. 睡前喝酒有助於提升安眠藥的療效
C. 在晚餐後仍可以飲用可樂、熱可可及巧克力
D. 因前一天睡不好，中午想補眠時卻睡不	，可服用短效安眠藥

正確答案：A. 處方安眠藥時，宜確定排除睡眠呼吸中止症候群